Moderate to severe rheumatoid arthritis

The above is a clinical trial inclusion criterion. Annotated with entity spans:
[Qualifier: Moderate to severe] [Condition: rheumatoid arthritis]